腋神經（axillary nerve）受損時，下列那一塊肌肉無力？
A. 三角肌（deltoid muscle）
B. 喙肱肌（coracobrachialis muscle）
C. 肱二頭肌（biceps brachii muscle）
D. 肱三頭肌（triceps brachii muscle）

正確答案：A. 三角肌（deltoid muscle）